Inability to attend scheduled clinic visits and/or comply with the study protocol.

The above is a clinical trial exclusion criterion. Annotated with entity spans:
[Post-eligibility: Inability to attend scheduled clinic visits and/or comply with the study protocol.]